Clinical trial exclusion criterion:
Cases of rectal tumours below 12cm from anal verge, or locally advanced tumours invading blood vessels, nerves or bone.

Annotated entities:
- Condition: "rectal tumours"
- Qualifier: "below 12cm from anal verge"
- Condition: "locally advanced tumours"
- Condition: "invading blood vessels"
- Condition: "nerves invading"
- Condition: "bone invading"